Clinical trial exclusion criterion:
Preoperative renal failure requiring dialysis

Entity relations:
- Has_mood("dialysis", "requiring")
- AND("renal failure", "dialysis")
- Has_temporal("renal failure", "Preoperative")